Which is the literature-based database of phenotypes?

PheneBank is a Web-portal for retrieving human phenotype-disease associations that have been text-mined from the whole of Medline.